Any history of receiving GLP-1 analogues or dipeptidyl peptidase inhibitors within 6 months

The above is a clinical trial exclusion criterion. Annotated with entity spans:
Any history of receiving [Drug: GLP-1 analogues] or [Drug: dipeptidyl peptidase inhibitors] [Temporal: within 6 months]